• Live vaccinations (3 months off drug)

The above is a clinical trial exclusion criterion. Annotated with entity spans:
• [Drug: Live vaccinations] ([Temporal: 3 months off drug])